Clinical trial exclusion criterion:
More than three doses of any opioid within one week of surgery

Annotated entities:
- Multiplier: "More than three doses"
- Drug: "opioid"
- Temporal: "within one week of surgery"
- Reference_point: "surgery"